Clinical trial exclusion criterion:
eGFR <45 ml/min

Annotated entities:
- Measurement: "eGFR"
- Value: "<45 ml/min"